Clinical trial inclusion criterion:
Two or more relapses in the previous year, whether on DMD treatment or not.

Annotated entities:
- Multiplier: "Two or more"
- Condition: "relapses"
- Temporal: "in the previous year"